Clinical trial exclusion criterion:
Pronounced congenital defects or serious chronic diseases in the acute stage, including any clinically important exacerbation of chronic diseases of the liver, kidney, cardiovascular, nervous system, mental diseases or metabolic disorders, confirmed by the history or objective examination (pulmonary: cystic fibrosis, lung abscess, empyema, active tuberculosis; extra-pulmonary: congestive heart failure, malabsorption, chronic renal and hepatic failure, cirrhosis, malignancy, immunodeficiency, cirrhosis of the liver);

Entity relations:
- Has_qualifier("chronic diseases", "acute stage")
- Has_qualifier("chronic diseases", "serious")
- Has_qualifier("tuberculosis", "active")
- Has_qualifier("hepatic failure", "chronic")
- Has_qualifier("diseases of the liver", "chronic")
- Has_qualifier("exacerbation", "clinically important")
- Subsumes("diseases of the liver", "cystic fibrosis")
- Subsumes("congenital defects", "diseases of the liver")
- Has_qualifier("renal failure", "chronic")
- Has_qualifier("diseases of the kidney", "chronic")
- Has_qualifier("diseases of the cardiovascular system", "chronic")
- Has_qualifier("diseases of the nervous system", "chronic")
- AND("diseases of the liver", "diseases of the kidney")
- AND("diseases of the kidney", "diseases of the cardiovascular system")
- AND("diseases of the cardiovascular system", "diseases of the nervous system")
- AND("diseases of the liver", "diseases of the kidney")
- AND("diseases of the kidney", "diseases of the cardiovascular system")
- AND("diseases of the cardiovascular system", "diseases of the nervous system")
- OR("congenital defects", "chronic diseases")
- OR("cystic fibrosis", "cirrhosis of the liver", "malignancy", "cirrhosis", "hepatic failure", "malabsorption", "congestive heart failure", "tuberculosis", "empyema", "lung abscess", "immunodeficiency")
- OR("exacerbation", "mental diseases", "diseases of the liver", "metabolic disorders")